multiple pregnancy

The above is a clinical trial exclusion criterion. Annotated with entity spans:
[Condition: multiple pregnancy]